Clinical trial exclusion criterion:
History of chronic diarrhea (lasting for more than 2 weeks in the past 6 months)

Entity relations:
- Has_temporal("chronic diarrhea", "History")
- Has_multiplier("chronic diarrhea", "lasting for more than 2 weeks")
- Has_temporal("chronic diarrhea", "in the past 6 months")